Clinical trial exclusion criterion:
Anti-hypertensive therapy received in the past 12 hours

Annotated entities:
- Procedure: "Anti-hypertensive therapy"
- Temporal: "past 12 hours"